Clinical trial exclusion criterion:
Positive serology for HIV, HCV, HBV.

Annotated entities:
- Measurement: "serology for HIV"
- Measurement: "serology for HCV"
- Measurement: "serology for HBV"
- Value: "Positive"